Other contraindications in package insert.

The above is a clinical trial exclusion criterion. Annotated with entity spans:
Other [Observation: contraindications in package insert].